Clinical trial exclusion criterion:
Have participated in any other studies involving investigational products within 30 days prior to entry into this study.

Entity relations:
- Has_index("within 30 days prior to entry into this study", "entry into this stud")
- Has_temporal("Have participated in any other studies involving investigational products", "within 30 days prior to entry into this study")